Señale la respuesta INCORRECTA en relación a la Cartera de Servicios de Atención Primaria:
1. Es la selección de servicios priorizada y organizada de una forma específica, que responde exclusivamente a prioridades de política sanitaria.
2. La unidad básica de la Cartera de Servicios es un conjunto de actividades o criterios de actuación que guían la atención a un problema o proceso de salud clínico o preventivo con especificación de la población a la que se dirige.
3. La estructura general puede presentar variantes en función del servicio de que se trate o de las distintas Comunidades Autónomas.
4. Su finalidad es promover la atención de los procesos más frecuentes y relevantes en AP con arreglo a criterios científico técnicos consensuados.
5. Permite reducir la variabilidad clínica evitable y facilitar la equidad en la prestación de servicios.

Respuesta correcta: 1. Es la selección de servicios priorizada y organizada de una forma específica, que responde exclusivamente a prioridades de política sanitaria.